Patients on strong CYP1A2 inhibitors: ciprofloxacin, fluvoxamine, methoxsalen, ofloxacin, primaquine

The above is a clinical trial exclusion criterion. Annotated with entity spans:
Patients on [Drug: strong CYP1A2 inhibitors]: [Drug: ciprofloxacin], [Drug: fluvoxamine], [Drug: methoxsalen], [Drug: ofloxacin], [Drug: primaquine]